Which molecule is targeted by Caplacizumab?

Caplacizumab is anti-von Willebrand factor (VWF) antibody that blocks the interaction between VWF and platelets. It is used for treatment of acquired thrombotic thrombocytopenic purpura (aTTP).